12. Patients with active connective tissue disease

The above is a clinical trial exclusion criterion. Annotated with entity spans:
[Parsing_Error: 12.] Patients with [Temporal: active] [Condition: connective tissue disease]